Infection in or near insertion site of the peripheral nerve catheter

The above is a clinical trial exclusion criterion. Annotated with entity spans:
Infection [Qualifier: in] or [Qualifier: near insertion site] of the [Device: peripheral nerve catheter]